下列何者不是神經纖維瘤第一型（neurofibromatosis type 1）的典型症狀？
A. 虹膜色素瘤（Lisch nodule）
B. 咖啡牛奶斑（café au lait spots）
C. 雙側聽神經瘤（bilateral acoustic neuromas）
D. 皮膚多發性神經纖維瘤（multiple skin neurofibromas）

正確答案：C. 雙側聽神經瘤（bilateral acoustic neuromas）